Which workflow in Bioconductor has been developed for accessing human RNA-seq samples?

The recount2 resource is composed of over 70,000 uniformly processed human RNA-seq samples spanning TCGA and SRA, including GTEx.